Clinical trial exclusion criterion:
Abuse of illicit drugs, according to medical decision;

Annotated entities:
- Condition: "Abuse of illicit drugs"
- Subjective_judgement: "according to medical decision"